Clinical trial inclusion criterion:
Currently on long term TDF anti-HBV treatment,

Entity relations:
- Has_multiplier("TDF", "long term")
- multi("TDF anti-HBV treatment", "TDF")
- multi("TDF anti-HBV treatment", "HBV")